有關病人在急診室處理鼻出血的敘述，下列何者錯誤？
A. 出血位置以鼻前部的 Kiesselbach plexus 最常見
B. 可使用鼻腔填塞法（nasal packing）治療
C. 治療時可先使用血管收縮劑
D. 若見出血點，急診醫師可先行使用化學燒灼或電燒止血

正確答案：D. 若見出血點，急診醫師可先行使用化學燒灼或電燒止血